一位 20 歲就讀於大學 2 年級的學生，常常利用電腦上網玩遊戲，近 3 星期他覺得右手掌麻麻的，尤其是大拇指及食指，而騎車時麻木感更加厲害，這兩天甚至拿筆寫字都覺得不靈活，因此他到門診求助。你認為他最可能的診斷是什麼？
A. 尺神經（ulnar nerve）病變
B. 橈神經（radial nerve）病變
C. 腕隧道症候群（carpal tunnel syndrome）
D. 臂神經叢病變（brachial plexus neuropathies）

正確答案：C. 腕隧道症候群（carpal tunnel syndrome）